Clinical trial inclusion criterion:
Have a total baseline score on the Brief Psychiatric Rating Scale (BPRS) = 45;

Annotated entities:
- Measurement: "Brief Psychiatric Rating Scale"
- Measurement: "BPRS"
- Value: "= 45"